Clinical trial exclusion criterion:
incapable of giving informed consent

Annotated entities:
- Post-eligibility: "incapable of giving informed consent"